Clinical trial exclusion criterion:
Cicatricial meibomian gland dysfunction

Entity relations:
- Has_qualifier("meibomian gland dysfunction", "Cicatricial")